How is Slc22a3 imprinted?

cis expression of the air rna